Pregnant woman or lactating woman.

The above is a clinical trial exclusion criterion. Annotated with entity spans:
[Condition: Pregnant] [Person: woman] or [Condition: lactating] [Person: woman].